Clinical trial exclusion criterion:
Patients with active systemic infection that requires the continued administration of antibiotics.

Annotated entities:
- Condition: "systemic infection"
- Qualifier: "active"
- Drug: "antibiotics"
- Multiplier: "continued administration"